Clinical trial inclusion criterion:
Adults patients aged 18 to 85 years

Annotated entities:
- Person: "Adults"
- Person: "aged"
- Value: "18 to 85 years"